Clinical trial inclusion criterion:
Subjects with documented physician diagnosis of asthma as their primary respiratory disease.

Entity relations:
- Has_qualifier("asthma", "primary respiratory disease")